Clinical trial exclusion criterion:
Evidence of the acquisition of HCV at the time of or after transplantation

Entity relations:
- Has_index("at the time of or after transplantation", "transplantation")
- Has_temporal("acquisition of HCV", "at the time of or after transplantation")